En relación a la inhibición enzimática:
1. Un inhibidor irreversible provoca la desnaturalización del enzima.
2. Los inhibidores acompetitivos se unen al sustrato de la reacción.
3. Un inhibidor no competitivo no necesita unirse al enzima para ejercer su actividad.
4. Todos los inhibidores modifican Vmàx.
5. Un inhibidor competitivo aumenta el valor de Km.

Respuesta correcta: 5. Un inhibidor competitivo aumenta el valor de Km.